Clinical trial exclusion criterion:
Pregnancy at enrollment.

Annotated entities:
- Condition: "Pregnancy"
- Temporal: "at enrollment"
- Reference_point: "enrollment"